Clinical trial exclusion criterion:
Use of other investigational drugs 30 days prior to the date of randomization

Entity relations:
- Has_temporal("other investigational drugs", "30 days prior to the date of randomization")